Using valproate

The above is a clinical trial exclusion criterion. Annotated with entity spans:
Using [Drug: valproate]